Which is the methyl donor of histone methyltransferases?

The major methyl donor of histone methyltransferases (HMTs) is S-adenosyl-L–methionine (SAM, AdoMet).